Clinical trial exclusion criterion:
Non survivable injury

Annotated entities:
- Condition: "injury"
- Qualifier: "Non survivable"